ASA classification >= IV.

The above is a clinical trial exclusion criterion. Annotated with entity spans:
[Measurement: ASA classification] [Value: >= IV].